Clinical trial exclusion criterion:
other things affecting hand function

Entity relations:
- Has_qualifier("other things", "affecting hand function")